周太太在懷孕17週時接受羊水穿刺（amniocentesis），檢查結果發現胎兒有唐氏症（Down syndrome），當時家境困苦的周太太仍決定保留胎兒。到23週時，超音波檢查發現羊水過少，胎兒有先天性心臟病「法洛氏四重症（tetralogy of Fallot）」，且兩側腎臟很小。經過2週的家族討論，產婦要求進行墮胎，因為晚期墮胎恐怕引來「殺胎」爭議，婦產科醫師拒絕執行。對此事件的下列評斷，何者最恰當？
A. 經醫學專家討論同意後，可施行晚期墮胎
B. 可催生自然產下後，不給予奶水而由嬰兒自然死亡
C. 未經法院核可之「殺胎」醫療行為屬犯法
D. 臺灣民法規定胎兒雖未出生，已具備權利能力

正確答案：A. 經醫學專家討論同意後，可施行晚期墮胎